¿Cuál de las siguientes moléculas diatómicas presenta la energía de enlace más baja?:
1. N2.
2. H2.
3. I2.
4. O2.
5. Cl2.

Respuesta correcta: 3. I2.